Clinical trial exclusion criterion:
Abnormal complete blood count. Any of the following:

Annotated entities:
- Measurement: "complete blood count"
- Value: "Abnormal"
- Condition: "Abnormal complete blood count"
- Undefined_semantics: "Abnormal complete blood count"
- Parsing_Error: "Any of the following:"